一位 35 歲婦女順利產下一男嬰，哺乳也正常。但產後一天嬰兒卻發生抽搐，嬰兒抽血檢查發現 Ca  5 mM，則下列敘述何者正確？
A. 母親可能有低血鈣以致嬰兒鈣攝取不足
B. 嬰兒可能維生素 D 不足
C. 母親可能副甲狀腺機能亢進
D. 嬰兒終身須服用鈣片

正確答案：C. 母親可能副甲狀腺機能亢進